Clinical trial exclusion criterion:
Recent (2-year) history or evidence of alcoholism or drug abuse

Entity relations:
- Subsumes("Recent", "2-year")
- Has_temporal("alcoholism", "history")
- Has_temporal("alcoholism", "Recent")
- OR("history", "evidence")
- OR("alcoholism", "drug abuse")